Las sustancias que contienen uno o más átomos diferentes al carbono como parte de un anillo se llaman compuestos:
1. Heterocíclicos.
2. Estereoisómeros.
3. Diastereoisómeros.
4. Enantiomeros.

Respuesta correcta: 1. Heterocíclicos.